Clinical trial exclusion criterion:
Serious hematologic disease (e.g. CML, MDS)

Annotated entities:
- Condition: "hematologic disease"
- Qualifier: "Serious"
- Condition: "CML"
- Condition: "MDS"